下列何種疾病不會有低血鉀合併代謝性鹼中毒？
A. Bartter's syndrome
B. Primary aldosteronism
C. Liddle's syndrome
D. Gordon's syndrome

正確答案：D. Gordon's syndrome